Clinical trial exclusion criterion:
Have bleeding or clotting disorder

Annotated entities:
- Condition: "bleeding disorder"
- Condition: "clotting disorder"